Clinical trial inclusion criterion:
No contraindication to CTA

Annotated entities:
- Procedure: "CTA"
- Condition: "contraindication"
- Negation: "No"